What is targeted by Pexidartinib?

Pexidartinib is a selective tyrosine kinase inhibitor against CSF1R.